下列何者為最常見之急性顏面神經麻痺原因？
A. Ramsay Hunt症候群
B. 貝爾氏麻痺（Bell palsy）
C. 顱底骨髓炎（skull base osteomyelitis）
D. 顳骨骨折（temporal bone fracture）

正確答案：B. 貝爾氏麻痺（Bell palsy）